secondary hypertension

The above is a clinical trial exclusion criterion. Annotated with entity spans:
[Condition: secondary hypertension]